Clinical trial exclusion criterion:
contraindication to laparoscopy

Entity relations:
- AND("contraindication", "laparoscopy")